Clinical trial inclusion criterion:
Diagnosis of diabetes mellitus according to World Health Organization criteria ( treatment with insulin or an oral hypoglycemic agent, twice random glucose measurements major than 200 mg/dl, or a fasting glucose major than 140 mg/dl)

Entity relations:
- Has_qualifier("diabetes mellitus", "World Health Organization criteria")
- Has_value("fasting glucose", "major than 140 mg/dl")
- Has_multiplier("random glucose measurements", "twice")
- Has_value("random glucose measurements", "major than 200 mg/dl")
- AND("treatment", "insulin")
- Subsumes("diabetes mellitus", "treatment")
- OR("treatment", "fasting glucose", "random glucose measurements")
- OR("insulin", "oral hypoglycemic agent")